What is the exoproteome?

Exoproteomics aims at describing and quantifying the proteins found outside of the cells.